Prior endobronchial treatment for emphysema

The above is a clinical trial exclusion criterion. Annotated with entity spans:
[Temporal: Prior] [Procedure: endobronchial treatment] for [Condition: emphysema]